對衝性腦挫傷（Contrecoup contusion）最常見下列何處出血？
A. 額葉底部出血
B. 胼胝體及橋腦頂部點狀出血
C. 中腦及橋腦中央大出血
D. 頂葉皮質點狀出血

正確答案：A. 額葉底部出血